Clinical trial exclusion criterion:
Patient is not medically fit to undergo the LIFT procedure as judged by the treating physician

Annotated entities:
- Subjective_judgement: "Patient is not medically fit to undergo the LIFT procedure as judged by the treating physician"
- Post-eligibility: "Patient is not medically fit to undergo the LIFT procedure as judged by the treating physician"